Clinical trial inclusion criterion:
Lesion length = 40

Annotated entities:
- Measurement: "Lesion length"
- Value: "= 40"